Clinical trial exclusion criterion:
Anticoagulant therapy during the past 1 week of the procedure

Entity relations:
- Has_index("during the past 1 week", "procedure")
- Has_temporal("Anticoagulant", "during the past 1 week")